Clinical trial inclusion criterion:
Presumed AJCC (American Joint Committee on Cancer) tumor Stage I or II

Entity relations:
- Subsumes("AJCC tumor Stage I", "American Joint Committee on Cancer")
- Has_value("AJCC tumor Stage I", "I")
- OR("I", "II")